Phase 2a Inclusion

The above is a clinical trial inclusion criterion. Annotated with entity spans:
[Parsing_Error: Phase 2a Inclusion]